Clinical trial inclusion criterion:
Hemoglobin > or = to 11.5g/dL

Entity relations:
- Has_value("Hemoglobin", "> or = to 11.5g/dL")